Clinical trial exclusion criterion:
Blood pressure greater than 140/90 and/or a pulse rate greater than 90 bpm

Annotated entities:
- Measurement: "Blood pressure"
- Value: "greater than 140/90"
- Measurement: "pulse rate"
- Value: "greater than 90 bpm"